Clinical trial exclusion criterion:
diabetes type 1 with complications

Entity relations:
- AND("diabetes type 1", "complications")